Male or female on stable dose of IgPro20 (Hizentra) therapy.

The above is a clinical trial inclusion criterion. Annotated with entity spans:
[Person: Male] or [Person: female] on [Qualifier: stable dose] of [Drug: IgPro20] ([Drug: Hizentra]) therapy.